Clinical trial exclusion criterion:
clinically significant ECG

Annotated entities:
- Qualifier: "clinically significant"
- Procedure: "ECG"